Clinical trial exclusion criterion:
Treatment with prednisolone (or prednisone, or equivalent) at >20 mg/D for over 4 weeks within the past 3 months.

Annotated entities:
- Drug: "prednisolone"
- Drug: "prednisone"
- Drug: "prednisone equivalent"
- Multiplier: ">20 mg/D for over 4 weeks"
- Temporal: "past 3 months"